下列關於凱格爾運動（Kegel exercises）的敘述，何者錯誤？
A. 輔以衛教單張是有效的指導方式
B. 醫護人員臨場指導可增加效果
C. 依原始的凱格爾理論，適用者應只限於孕婦
D. 輔以生理回饋器材（biofeedback devices）可增加運動的效果

正確答案：C. 依原始的凱格爾理論，適用者應只限於孕婦